Clinical trial exclusion criterion:
no confirmation of the gestational age

Entity relations:
- Has_negation("gestational age", "no")